Clinical trial inclusion criterion:
High risk for cardiac surgery (STS and logistic Euroscore ),

Entity relations:
- Has_qualifier("cardiac surgery", "High risk")
- Has_qualifier("cardiac surgery", "STS")
- OR("STS", "logistic Euroscore")